Not pregnant at the time of enrollment

The above is a clinical trial inclusion criterion. Annotated with entity spans:
[Negation: Not] [Condition: pregnant] [Temporal: at the time of enrollment]